Clinical trial exclusion criterion:
Systolic pressure =180 mmHg or diastolic pressure =110 mmHg;

Entity relations:
- Has_value("diastolic pressure", "=110 mmHg")
- Has_value("Systolic pressure", "=180 mmHg")
- OR("Systolic pressure", "diastolic pressure")